La menopausia se diagnostica por:
1. La presencia de ciclos más frecuentes y abundantes de lo que corresponde al patrón propio de cada mujer.
2. La ausencia de menstruación en doce meses consecutivos.
3. Los síntomas derivados de la deprivación estrogénica, como el insomnio, los sofocos o la sequedad de piel y mucosas.
4. El espaciamiento de las reglas, que se hacen cada vez más infrecuentes.
5. Analíticas hormonales, densitometría, mamografía y citología.

Respuesta correcta: 2. La ausencia de menstruación en doce meses consecutivos.